Negative cardiac troponin test before the index elective PCI.

The above is a clinical trial inclusion criterion. Annotated with entity spans:
[Value: Negative] [Measurement: cardiac troponin test] [Temporal: before the index elective PCI.]